The ability to perform the requirements of the Protocol;

The above is a clinical trial inclusion criterion. Annotated with entity spans:
[Post-eligibility: The ability to perform the requirements of the Protocol;]